Clinical trial inclusion criterion:
Oligomenorrhea/amenorrhea or polycystic syndrome (defined according to the Rotterdam criteria 2004)

Entity relations:
- Has_qualifier("polycystic syndrome", "Rotterdam criteria 2004")
- OR("Oligomenorrhea", "polycystic syndrome", "amenorrhea")